Clinical trial exclusion criterion:
Patients under the age of 18 (Subjects under the age of 18 will not be included in this study due to the continued growth and development of their joints and unstudied effects on children.)

Annotated entities:
- Person: "age"
- Value: "18 under"
- Non-representable: "(Subjects under the age of 18 will not be included in this study due to the continued growth and development of their joints and unstudied effects on children.)"